Se realiza una estimación poblacional de los niveles de creatinina en sangre, en un grupo de mujeres     embarazadas,     obteniéndose    los siguientes resultados: media (×) 0,8 mg/dL; desviación típica (s) 0,62 mg/dL; tamaño muestral (n) 85 mujeres. Según los datos anteriores el intervalo de confianza para la media poblacional (µ) con un nivel de confianza de 95% (Z=1,96), es:
1. 0,8 ± 0,04.
2. 0,8 ± 0,13.
3. 0,8 ± 0,62.
4. 0,8 ± 1,96.
5. 0,8 ± 0,07.

Respuesta correcta: 2. 0,8 ± 0,13.